Clinical trial exclusion criterion:
17. Significant peripheral edema as per investigator's discretion

Annotated entities:
- Parsing_Error: "17."
- Condition: "peripheral edema"
- Qualifier: "Significant"
- Subjective_judgement: "Significant"
- Subjective_judgement: "as per investigator's discretion"